Clinical trial exclusion criterion:
more or equal to American Society of Anesthesiologist (ASA) class III

Annotated entities:
- Measurement: "American Society of Anesthesiologist (ASA) class"
- Value: "III more or equal to"